Con ecografía vaginal, ¿a partir de cuánto tiempo desde de la concepción es posible ver un embrión con latido cardiaco?
1. Entre 14 y 21 días.
2. Entre 21 y 28 días.
3. Entre 28 y 35 días.
4. Entre 35 y 42 días.
5. Entre 42 a 49 días.

Respuesta correcta: 2. Entre 21 y 28 días.